Clinical trial exclusion criterion:
Major surgical procedure or significant traumatic injury within approximately 28 days prior to randomization or anticipation of the need for major surgery during the course of study treatment.

Entity relations:
- Has_qualifier("traumatic injury", "significant")
- Has_qualifier("surgical procedure", "Major")
- Has_index("within approximately 28 days prior to randomization", "randomization")
- Has_temporal("surgical procedure", "within approximately 28 days prior to randomization")
- Has_mood("major surgery", "anticipation of the need")
- Has_index("during the course of study treatment", "study treatment")
- multi("study treatment", "treatment")
- Has_temporal("major surgery", "during the course of study treatment")
- OR("surgical procedure", "traumatic injury")
- OR("surgical procedure", "major surgery")